Clinical trial exclusion criterion:
Evidence of decompensated liver disease

Annotated entities:
- Qualifier: "decompensated"
- Condition: "liver disease"